Planned thoracoscopy with low probability(by surgeon estimate) of conversion to open procedure

The above is a clinical trial inclusion criterion. Annotated with entity spans:
[Non-query-able: Planned thoracoscopy with low probability(by surgeon estimate) of conversion to open procedure]